下列何種藥物在治療兒童急性前髓性白血病（acute promyelocytic leukemia）較無療效？
A. 全反式視黃醛酸（all-trans retinoic acid）
B. idarubicin
C. 甲型干擾素（interferon-α）
D. 三氧化二砷（arsenic trioxide）

正確答案：C. 甲型干擾素（interferon-α）